陳女士今年 55 歲患有糖尿病 15 年之久。近半年來陳女士常有視力模糊、下肢水腫及尿中泡沫增多等症狀。她在眼科檢查得知有糖尿病視網膜病變（diabetic retinopathy）。之後被轉介到腎臟科門診，一系列檢查結果如下：血漿：BUN 42 mg/dL, Creatinine 3.0 mg/dL, Na+ 145 mEq/L, K+ 5.3 mEq/L, Albumin 3.0 g/dL, Cholesterol 350 mg/dL, Triglyceride 400 mg/dL。24 小時尿液檢查：Volume 1000 mL; Protein 450 mg/dL, Creatinine 120 mg/dL, Na+ 44 mEq/L。請計算出陳女士的肌酸酐廓清率（clearance of creatinine, mL/min）：
A. 56
B. 40
C. 28
D. 20

正確答案：C. 28